Impact on overall severe (grade 3 or 4 of the WHO scale) not attributable to the LAL

The above is a clinical trial exclusion criterion. Annotated with entity spans:
[Non-representable: Impact on overall severe (grade 3 or 4 of the WHO scale) not attributable to the LAL]